有關腸	疊（intussusception）之敘述，下列何者正確？
A. 女性的發生率約為男性的3倍
B. 典型的症狀是出現一陣一陣的腹痛
C. 迴腸-迴腸型（ileoileal）腸	疊最常發生
D. 鋇劑灌腸復位（barium enema reduction）後的復發率小於1%

正確答案：B. 典型的症狀是出現一陣一陣的腹痛